What is the effect of carbamazepine on CYP3A4?

Carbamazepine is an inducer of CYP3A4.